Clinical trial inclusion criterion:
The patients' ECOG scores are =0-2.

Annotated entities:
- Measurement: "ECOG scores"
- Value: "=0-2"